En el análisis de un pedigrí de un rasgo autosómico recesivo:
1. El rasgo aparece más frecuentemente.
2. Las personas afectadas no transmiten el rasgo.
3. Es rasgo tiende a saltar generaciones.
4. El rasgo aparece más frecuentemente en mujeres.

Respuesta correcta: 3. Es rasgo tiende a saltar generaciones.